En relación a la administración de analgésicos no opioides, se deben considerar las recomendaciones que se relacionan a continuación, EXCEPTO:
1. No administrar ácido acetil salicílico a niños ni adolescentes.
2. Tomar la medicación con alimento y líquido abundante para prevenir molestias gástricas.
3. Notificar antecedentes de trastornos hemorrágicos.
4. Ajustar la posología en 600 mg/24 horas.
5. Mantener las citas programadas para las pruebas de función renal y hepática.

Respuesta correcta: 4. Ajustar la posología en 600 mg/24 horas.